La glucogenina:
1. Cataliza la conversión de almidón en glucógeno.
2. Es la enzima responsable de la formación de ramificaciones en el glucógeno.
3. Es el gen que codifica la glucógeno sintasa.
4. Es el cebador sobre el que se inician nuevas cadenas de glucógeno.
5. Regula la síntesis de glucógeno.

Respuesta correcta: 4. Es el cebador sobre el que se inician nuevas cadenas de glucógeno.